Stable health

The above is a clinical trial inclusion criterion. Annotated with entity spans:
[Condition: Stable health]